Clinical trial inclusion criterion:
Female participants of childbearing potential must have a negative serum pregnancy test (beta human chorionic gonadotropin [beta hCG]) at the Screening visit, and a negative urine pregnancy test pre-dose on Day 1

Annotated entities:
- Person: "Female"
- Condition: "childbearing potential"
- Measurement: "serum pregnancy test"
- Value: "negative"
- Measurement: "beta human chorionic gonadotropin [beta hCG]"
- Temporal: "at the Screening visit"
- Reference_point: "Screening visit"
- Measurement: "urine pregnancy test"
- Value: "negative"
- Temporal: "pre-dose on Day 1"
- Reference_point: "Day 1"
- Grammar_Error: "pre-dose"